Clinical trial exclusion criterion:
2. Contraindication or allergy to paracetamol or artesunate therapy

Annotated entities:
- Parsing_Error: "2."
- Condition: "Contraindication"
- Condition: "allergy"
- Drug: "paracetamol"
- Drug: "artesunate"